膽固醇（cholesterol）是心血管疾病的重要危險因子，下列敘述何者錯誤？
A. 身體內膽固醇一部分是經腸道吸收
B. 身體內也可以合成膽固醇，以 acetyl-CoA 當原料
C. 膽固醇在肝臟是合成膽酸（bile acid）的原料
D. 降膽固醇藥物 statin 是膽固醇合成反應的 HMG-CoA synthase 之抑制劑

正確答案：D. 降膽固醇藥物 statin 是膽固醇合成反應的 HMG-CoA synthase 之抑制劑